Subjects who are unlikely to comply with protocol requirements, e.g. uncooperative attitude, inability to return for the final visit

The above is a clinical trial exclusion criterion. Annotated with entity spans:
[Non-query-able: Subjects who are unlikely to comply with protocol requirements, e.g. uncooperative attitude, inability to return for the final visit]